Clinical trial inclusion criterion:
Age: 18-45 years old

Entity relations:
- Has_value("Age", "18-45 years old")